一位肝硬化患者，常發生肝昏迷，每次抽血檢查都被告知有電解質不平衡，是引起肝昏迷主要原因之一，較會誘發肝昏迷之電解質不平衡狀態是下列何項？
A. 低鈉血症或低鉀血症
B. 高鈉血症或低鉀血症
C. 低鈉血症或高鉀血症
D. 高鈉血症或高鉀血症

正確答案：A. 低鈉血症或低鉀血症